Straining during =25% of defecations

The above is a clinical trial inclusion criterion. Annotated with entity spans:
[Condition: Straining] during [Multiplier: =25%] of [Condition: defecations]